一新生男嬰，出生時體重 2950 克，在嬰兒室餵奶量正常。一個月後，母親發現餵奶量減少，嘔吐次數增加，上腹部摸到橄欖狀腫塊，則 可能的診斷為何？
A. 梅克爾氏憩室（Meckel diverticulum）
B. 膽道閉鎖（biliary atresia）
C. 賁門痙攣（cardiospasm）
D. 幼兒性肥大性幽門狹窄（infantile hypertrophic pyloric stenosis）

正確答案：D. 幼兒性肥大性幽門狹窄（infantile hypertrophic pyloric stenosis）